Clinical trial inclusion criterion:
After the investigator has taken the decision to use human insulin or insulin analogues to treat the subject, any type 2 diabetic previously inadequately controlled with two or more OADs is eligible for the study

Annotated entities:
- Condition: "type 2 diabetic"
- Qualifier: "inadequately controlled"
- Temporal: "previously"
- Multiplier: "two or more"
- Condition: "OADs"
- Non-representable: "After the investigator has taken the decision to use human insulin or insulin analogues to treat the subject"